Clinical trial exclusion criterion:
Significant valvular heart disease, congenital heart disease, pulmonary heart disease or perinatal heart disease.

Entity relations:
- Has_qualifier("valvular heart disease", "Significant")
- OR("valvular heart disease", "congenital heart disease", "pulmonary heart disease", "perinatal heart disease")